concomitant use of clopidogrel, or (9) Unwilling to accept random assignment of subjects

The above is a clinical trial inclusion criterion. Annotated with entity spans:
[Temporal: concomitant] use of [Drug: clopidogrel], or (9) [Informed_consent: Unwilling to accept random assignment of subjects]